Clinical trial inclusion criterion:
Men: (0.006012 x H3) + (14.6 x W) + 604 = TBV

Entity relations:
- Has_value("TBV", "(0.006012 x H3) + (14.6 x W) + 604 =")